Clinical trial exclusion criterion:
current or recent (within one week of surgery) systemic antibiotic use, intolerance to both clindamycin and cephalexin, discovery of a persistent cutaneous malignancy at the site of the defect following the reconstructive procedure and previous reconstruction at the site of the skin/soft-tissue defect.

Entity relations:
- AND("intolerance", "clindamycin")
- AND("intolerance", "cephalexin")
- Has_qualifier("persistent cutaneous malignancy", "site of the defect")
- AND("the reconstructive procedure", "reconstructive procedure")
- multi("following the reconstructive procedure", "the reconstructive procedure")
- Has_temporal("persistent cutaneous malignancy", "following the reconstructive procedure")
- Subsumes("recent", "within one week of surgery")
- Has_temporal("antibiotic", "current")
- OR("antibiotic", "intolerance", "persistent cutaneous malignancy")
- OR("current", "recent")